Clinical trial inclusion criterion:
History of chickenpox or positive test for antibodies against varicella zoster virus (VZV)

Annotated entities:
- Condition: "chickenpox"
- Measurement: "test for antibodies"
- Value: "positive"
- Qualifier: "varicella zoster virus"
- Qualifier: "VZV"